Clinical trial inclusion criteria:
Women stimulated with Syntocinon® infusion for induction of labour (with or without cervical priming by prostaglandin)

Annotated entities:
- Person: "Women"
- Drug: "Syntocinon®"
- Procedure: "Syntocinon® infusion"
- Procedure: "induction of labour"
- Procedure: "cervical priming"
- Drug: "prostaglandin"